一中年病患突發縱膈腔氣腫（pneumomediastinum），下列何種鑑別診斷最不可能？
A. 急性氣喘發作
B. 縱膈腔腫瘤
C. 食道破裂
D. 頸部深組織感染

正確答案：B. 縱膈腔腫瘤